index event is an acute complication (< 30 days) of PCI

The above is a clinical trial inclusion criterion. Annotated with entity spans:
index event is an [Qualifier: acute] [Condition: complication] ([Value: < 30 days]) of PCI